Clinical trial inclusion criterion:
Treating surgeon has recommended surgical repair of the aneurysm

Entity relations:
- AND("surgical repair", "aneurysm")
- Has_mood("surgical repair", "recommended")
- Has_qualifier("recommended", "Treating surgeon")